Mujer de 29 años de edad con antecedentes de reglas abundantes y anemia ferropénica de larga evolución que ha precisado tratamiento con ferroterapia desde los 17 años. Consulta porque tras una extracción dental tiene hemorragia que ha precisado tratamiento hemostático local. Relata que una tía materna presenta epistaxis frecuentes. En analítica presenta: 8000 leucocitos/uL, Hb 10,7 g/dL, VCM 76 fL, 380.000 plaquetas/uL;              la bioquímica     es   normal.    Actividad     de protrombina 90%; INR 0,9; Tiempo de Tromboplastina Parcial Activado (TTPA) 48 seg (39 seg) con un TTPA ratio de 1,3 y fibrinógeno derivado 340 mg/dL. ¿Cuál es la sospecha diagnóstica más probable y cómo lo confirmaría?
1. Hemofilia A y prueba de mezclas.
2. Anticoagulante lúpico y estudio de ANAS.
3. Anemia sideroblástica y aspirado medular.
4. Trombocitopatía congénita y estudio de agregación plaquetaria.
5. Enfermedad     de     von   Willebrand       y determinación de factor vW.

Respuesta correcta: 5. Enfermedad     de     von   Willebrand       y determinación de factor vW.